有關炭疽桿菌（Bacillus anthracis）的敘述，下列何者錯誤？
A. 由多胜肽（polypeptide）所組成的莢膜為重要的毒力因子（virulence factor）
B. 為毛工病（wool-sorter's disease）的致病菌
C. 在含血液培養盤上可形成大型β-溶血菌落
D. 炭疽毒素（anthrax toxin）的基因位於質體上

正確答案：C. 在含血液培養盤上可形成大型β-溶血菌落